Clinical trial exclusion criterion:
Tubal ligation and infertility surgery

Entity relations:
- OR("Tubal ligation", "infertility surgery")